下列有關動脈導管（ductus arteriosus）之敘述，何者正確？
A. 源自右側第六動脈弓（aortic arch）
B. 連接右側肺動脈（pulmonary artery）及主動脈弓（aortic arch）
C. 出生後，閉鎖形成動脈韌帶（ligamentum arteriosum）
D. 右側喉返神經（recurrent laryngeal nerve）自動脈韌帶（ligamentum arteriosum）旁通過

正確答案：C. 出生後，閉鎖形成動脈韌帶（ligamentum arteriosum）